結腸（colon）不具備下列那一項特徵？
A. 杯狀細胞（goblet cells）
B. 單層柱狀上皮（simple columnar epithelium）
C. 潘氏細胞（Paneth cells）
D. 淋巴小結（lymphatic nodules）

正確答案：C. 潘氏細胞（Paneth cells）